Clinical trial inclusion criterion:
Patient must consent to the procedure

Annotated entities:
- Observation: "consent to the procedure"